一位8歲男孩主訴發燒已有2-3星期。男孩自小被診斷有第二型心室中隔缺損，身體理學檢查發現心跳108次/min，體溫38.5℃，在左胸骨側有grade Ⅲ/Ⅵ 收縮期心雜音，在右肋骨下方可觸摸到肝臟邊緣，在左肋骨下方可觸摸到 2 公分的脾臟。口腔衛生狀況不佳，蛀牙多。下列何種狀況最需要列入鑑別診斷？
A. 蛀牙引起的牙髓炎
B. 感染性心內膜炎（infective endocarditis）
C. 川崎症（Kawasaki disease）
D. 紅斑性狼瘡（lupus erythematosus）

正確答案：B. 感染性心內膜炎（infective endocarditis）